Clinical trial exclusion criterion:
Significant anemia (Hb < 90 g/l)

Entity relations:
- Has_qualifier("anemia", "Significant")
- Has_value("Hb", "< 90 g/l")
- Subsumes("anemia", "Hb")